Clinical trial inclusion criterion:
Alanine aminotransferase, alkaline phosphatase and bilirubin <=1.5x upper limit of normal (ULN) (isolated bilirubin >1.5xULN is acceptable if bilirubin is fractionated and direct bilirubin <35%).

Annotated entities:
- Measurement: "Alanine aminotransferase"
- Measurement: "alkaline phosphatase"
- Measurement: "bilirubin"
- Value: "<=1.5x upper limit of normal (ULN)"
- Measurement: "bilirubin"
- Value: ">1.5xULN"
- Measurement: "direct bilirubin"
- Grammar_Error: "(isolated bilirubin >1.5xULN is acceptable if bilirubin is fractionated and direct bilirubin <35%)"